No prior treatment with Ventavis or other active treatments for primary pulmonary hypertension within 6 weeks of date of study inclusion (unless otherwise advised by Bayer Schering Pharma)

The above is a clinical trial inclusion criterion. Annotated with entity spans:
[Negation: No] prior [Procedure: treatment with Ventavis] or other active [Procedure: treatments] [Qualifier: for primary pulmonary hypertension] [Temporal: within 6 weeks of date of study inclusion] (unless otherwise advised by Bayer Schering Pharma)